一位 35 歲女性因多尿就醫。限水試驗前，其血液滲透壓 288 mOsm/kg（normal 282-295 mOsm/kg），尿液滲透壓 250 mOsm/kg，限水試驗 6 小時後，其血液滲透壓298 mOsm/kg，尿液滲透壓300 mOsm/kg，皮下注射 pitressin 5 單位後 1 小時，其血液滲透壓 290 mOsm/kg，尿液滲透壓 550 mOsm/kg。最可能之診斷為：
A. 腦下垂體部分 ADH 分泌不足
B. 腦下垂體全部 ADH 分泌不足
C. 心理性飲水過量
D. 腎原性尿崩症

正確答案：B. 腦下垂體全部 ADH 分泌不足